7. Have an ALT/AST>3x upper limit of normal.

The above is a clinical trial exclusion criterion. Annotated with entity spans:
7. Have an [Measurement: ALT/AST][Value: >3x upper limit of normal].